Señale a cuál de las siguientes autoras se le atribuye el origen del término “Proceso de Enfermería”:
1. M. Gordon.
2. E. Fry.
3. E. Wiedenbach.
4. L. Hall.

Respuesta correcta: 4. L. Hall.